一位23歲大學王姓女畢業生規劃去位於菲律賓首都馬尼拉的貿易公司上班，在出發前兩週，因平常有過敏性鼻炎而先自行到住家附近的李姓家醫科診所拿藥。醫師問病史時王女除了提到鼻塞、流鼻水外，還表示偶而會有胸悶的症狀，但並無其他任何不適。而醫師在作身體診查時聽診前胸，發現有grade 1-2的mid-systolic  murmur，於是醫師要王女轉診去附近的區域醫院作進一步檢查。王女到了區域醫院的心臟科門診就診，在問診確定病史和身體診查發現如同轉診單所記載後，其最合適的處置為：
A. 直接安排做心臟超音波檢查，再決定如何處置
B. 直接安排做ECG檢查，如無異常，即可不用再做其他檢查
C. 直接安排做CXR檢查，如無異常，再做心臟超音波檢查，之後再決定如何處置
D. 直接安排做ECG和CXR檢查，如無異常，即可不用再做其他檢查

正確答案：D. 直接安排做ECG和CXR檢查，如無異常，即可不用再做其他檢查